工作場所中的物理性危害多來自於下列那一項？
A. 產品材料
B. 勞工長工時
C. 特殊機具使用
D. 工廠佈置

正確答案：C. 特殊機具使用